Clinical trial inclusion criterion:
General Condition WHO 0, 1 or 2,

Annotated entities:
- Measurement: "General Condition WHO"
- Value: "0"
- Value: "1"
- Value: "2"